下列何者不適合利用 restriction fragment length polymorphism（RFLP）分析？
A. DNA指紋鑑定（DNA fingerprinting）
B. 疾病基因之定位
C. 可能遺傳缺陷的產前篩選
D. 建立cDNA library

正確答案：D. 建立cDNA library